下列何者之訊息在投射至大腦前並不經過視丘？
A. 嗅覺
B. 視覺
C. 聽覺
D. 觸覺

正確答案：A. 嗅覺